Clinical trial inclusion criterion:
Diagnosis of idiopathic Parkinson's disease that is optimally treated (motor fluctuations <20% of subject's awake time). Subjects may be on levodopa therapy but must be stable at the time of entry into the study

Entity relations:
- Has_qualifier("idiopathic Parkinson's disease", "treated")
- Has_value("motor fluctuations", "<20% of subject's awake time")